Have an indication for induction or attempted induction of labor according to Parkland protocol

The above is a clinical trial inclusion criterion. Annotated with entity spans:
Have an [Condition: indication] for [Procedure: induction] or [Qualifier: attempted] [Procedure: induction] of labor according to [Procedure: Parkland protocol]